以下那個遺傳基因變異導致卵巢癌發生的風險最高？
A. BRCA1
B. BRCA2
C. MSH2
D. CHK2

正確答案：A. BRCA1